Clinical trial inclusion criteria:
Male and females between ages 18-85 years of age
SCI ( =1 month of injury)
ASIA A, B,C and D
SCI above L5
Able to perform a visible contraction with dorsiflexor and hip flexor muscles (allowing testing of largely impaired patients)
Able to ambulate a few steps with or without an assistive device
Male and females between ages 18-85 years of age
Able to walk and complete lower-limb tests with both legs

Annotated entities:
- Person: "Male"
- Person: "females"
- Value: "between 18-85 years of age"
- Person: "ages"
- Condition: "SCI"
- Temporal: "=1 month of injury"
- Measurement: "ASIA"
- Value: "A, B,C and D"
- Measurement: "SCI"
- Value: "above L5"
- Non-representable: "Able to perform a visible contraction with dorsiflexor and hip flexor muscles (allowing testing of largely impaired patients)"
- Condition: "Able to ambulate a few steps"
- Qualifier: "without an assistive device"
- Qualifier: "with assistive device"
- Person: "females"
- Person: "l"
- Value: "between 18-85 years of age"
- Person: "ages"
- Condition: "Able to walk"
- Condition: "Able to complete lower-limb tests"
- Qualifier: "with both legs"